Clinical trial inclusion criterion:
Have symptoms of vaginal odor and or/discharge

Entity relations:
- Has_mood("vaginal odor", "symptoms of")
- OR("vaginal odor", "vaginal discharge")